Contraindications to general anesthesia

The above is a clinical trial exclusion criterion. Annotated with entity spans:
[Condition: Contraindications to general anesthesia]